Scheduled major surgery in the next 6 months;

The above is a clinical trial exclusion criterion. Annotated with entity spans:
[Mood: Scheduled] [Procedure: major surgery] [Temporal: in the next 6 months];